有一肝硬化的病人，來急診主訴 8 小時前在釣魚時，右腳被牡蠣殼割傷後，右下肢紅腫並迅速往小腿擴散，併有水泡出現及組織壞死現象，除此之外，伴隨著發燒發冷的現象。關於該病人疾病，下列敘述何者錯誤？
A. 需詳細詢問病人接觸史，包含海水暴露史
B. 若無海水暴露史，即可排除壞死性筋膜炎
C. 食用未煮熟的海鮮也有可能引發壞死性筋膜炎
D. 若病人皮膚未明顯發紅，但病人表示劇烈疼痛，仍不可排除壞死性筋膜炎

正確答案：B. 若無海水暴露史，即可排除壞死性筋膜炎